母親懷疑2歲女兒誤食異物而將她帶至急診室，母親主訴女童過去一直很好，剛才與哥哥在遊戲室玩耍，哥哥 發現女童疑似吞下某物體，並開始咳嗽及哭泣，檢查時發現女童無發紺，呼吸略快，呼吸音正常，下列何項為最適當的處置？
A. 衛教後返家觀察
B. 頸部及胸部X光檢查
C. 上消化道鋇劑檢查
D. 電腦斷層攝影檢查

正確答案：B. 頸部及胸部X光檢查